Clinical trial exclusion criterion:
Presence of inflammatory arthropathy or neuropathy

Annotated entities:
- Condition: "inflammatory arthropathy"
- Condition: "neuropathy inflammatory"